巴金森氏病人服用左多巴（levodopa）者，會比服用多巴胺促效劑（dopamine agonist）者容易出現下列何種副作用？
A. 異動症（dyskinesia）
B. 肢體水腫
C. 幻覺（hallucination）
D. 衝動控制失調（impulse control disorder）

正確答案：A. 異動症（dyskinesia）